conditions that may lead to complicated infections (i.e. renal diseases, patients with urinary catheter)

The above is a clinical trial exclusion criterion. Annotated with entity spans:
[Condition: conditions] that may lead to [Condition: complicated infections] (i.e. [Condition: renal diseases], [Person: patients] with [Device: urinary catheter])